Clinical trial inclusion criterion:
Normal range for their height and weight. Weight and height measurements should fall within the percentile range 3-97% of normal values for age according to Danish growth charts.

Annotated entities:
- Measurement: "height"
- Value: "Normal range"
- Measurement: "weight"
- Measurement: "Weight"
- Measurement: "height"
- Value: "within the percentile range 3-97%"